anyone seriously ill

The above is a clinical trial exclusion criterion. Annotated with entity spans:
anyone [Condition: seriously ill]